Clinical trial exclusion criterion:
younger than 18 years old

Annotated entities:
- Value: "younger than 18 years"
- Person: "old"